一名40歲男性糖尿病患者，定期接受降血糖（metformin）和血壓藥物（amlodipine）治療，其居家血壓維持 138/86 mmHg，最近HbA1c為6.8%，血紅素10.7 g/dL，尿蛋白1.5 g/day，estimated GFR 59 mL/min per 1.73
A. 輔以低劑量長效型胰島素
B. 使用紅血球生成素減緩腎功能惡化
C. 加上血管張力素受器阻斷劑
D. 進行低蛋白飲食合併胺基酸補充品

正確答案：C. 加上血管張力素受器阻斷劑